下列關於食道的敘述，何者正確？
A. 上食道之外肌層（muscularis externa）僅含有平滑肌
B. 黏膜層（mucosa layer）具許多杯狀細胞（goblet cells）
C. 具黏膜下腺（submucosal gland）
D. 胸腔段有漿膜（serosa）包覆

正確答案：C. 具黏膜下腺（submucosal gland）